Patients with heart failure.

The above is a clinical trial exclusion criterion. Annotated with entity spans:
Patients with [Condition: heart failure].